Clinical trial exclusion criterion:
Rheumatoid arthritis

Annotated entities:
- Condition: "Rheumatoid arthritis"